Clinical trial exclusion criterion:
secondary osteosarcoma or well-differentiated parosteal osteosarcoma

Entity relations:
- Has_qualifier("parosteal osteosarcoma", "well-differentiated")
- OR("secondary osteosarcoma", "parosteal osteosarcoma")